Clinical trial exclusion criteria:
1. Decrease in size of the designated target ulcer(s) by ≥ 30% during the 7-day screening period
2. Cannot tolerate or comply with compression therapy.
3. An ulcer which shows signs of severe clinical infection, defined as pus oozing from the ulcer site
4. An ulcer positive for β-hemolytic streptococci upon culture
5. The ulcer has > 50% slough, significant necrotic tissue, bone, tendon, or capsule exposure or avascular ulcer beds
6. Is highly exuding (i.e. requires daily change of dressing)
7. Ankle brachial pressure index <0.65
8. Patients with active systemic infections
9. Patients with clinically significant medical conditions as determined by the investigator including renal, hepatic, hematologic, neurologic or immune disease. Examples include but are not limited to:
1. Renal insufficiency as an estimated GFR which is < 30 mL/min/1.7m2
2. Abnormal blood biochemistry defined as 3 times that of the upper limit of the normal range.
3. Hepatic insufficiency defined as total bilirubin > 2 mg/dL or serum albumin < 25 g/L
4. HbA1c > 9%
5. Hemoglobin < 10 g/dL
6. Hematocrit < 0.30
7. Platelet count < 100,000
10. Presence of an active systemic or local cancer or tumor of any kind (with the exception of non-melanoma skin cancer)
11. Patients with severe rheumatoid arthritis (with more than 20 persistently inflamed joints, or below lower normal limit blood albumin level, or evidence of bone and cartilage damage on x-ray, or inflammation in tissues other than joints) and other collagen vascular diseases.
12. Patients with active connective tissue disease
13. Treatment with systemic corticosteroids (>15 mg/day), or current immunosuppressive agents
14. Previous or current radiation therapy or likelihood to receive this therapy during study participation
15. Pregnant or nursing patients
16. Known prior inability or unavailability to complete required study visits during study participation
17. Significant peripheral edema as per investigator's discretion
18. A psychiatric condition (e.g., suicidal ideation) or chronic alcohol or drug abuse problem, determined from the patient's medical history, which, in the opinion of the investigator, may pose a threat to patient compliance
19. Use of a platelet-derived growth factor within 28 days before screening
20. Use of any investigational drug or therapy within 28 days before screening
21. Has any other factor which may, in the opinion of the investigator, compromise participation and/or follow-up in the study

Annotated entities:
- Parsing_Error: "1."
- Condition: "target ulcer"
- Qualifier: "Decrease in size"
- Value: "≥ 30%"
- Temporal: "during the 7-day screening period"
- Parsing_Error: "2."
- Procedure: "compression therapy"
- Non-query-able: "Cannot tolerate or comply with"
- Post-eligibility: "Cannot tolerate or comply with"
- Parsing_Error: "3."
- Condition: "pus"
- Condition: "ulcer"
- Qualifier: "shows signs of severe clinical infection"
- Subjective_judgement: "shows signs of severe clinical infection"
- Condition: "severe clinical infection"
- Parsing_Error: "4."
- Condition: "ulcer"
- Qualifier: "positive for β-hemolytic streptococci"
- Parsing_Error: "5."
- Measurement: "slough"
- Value: "> 50%"
- Condition: "ulcer"
- Observation: "necrotic tissue"
- Observation: "bone exposure"
- Observation: "capsule exposure"
- Observation: "tendon exposure"
- Observation: "avascular ulcer beds"
- Parsing_Error: "6."
- Qualifier: "highly exuding"
- Subjective_judgement: "highly exuding"
- Multiplier: "daily"
- Procedure: "change of dressing"
- Parsing_Error: "7."
- Measurement: "Ankle brachial pressure index"
- Value: "<0.65"
- Parsing_Error: "8."
- Condition: "systemic infections"
- Temporal: "active"
- Parsing_Error: "9."
- Condition: "medical conditions"
- Qualifier: "clinically significant"
- Observation: "as determined by the investigator"
- Subjective_judgement: "as determined by the investigator"
- Condition: "renal disease"
- Condition: "immune disease"
- Condition: "hepatic disease"
- Condition: "hematologic disease"
- Condition: "neurologic disease"
- Parsing_Error: "Examples include but are not limited to:"
- Parsing_Error: "1."
- Condition: "Renal insufficiency"
- Measurement: "estimated GFR"
- Value: "< 30 mL/min/1.7m2"
- Parsing_Error: "2."
- Measurement: "blood biochemistry"
- Value: "3 times that of the upper limit of the normal range"
- Value: "Abnormal"
- Parsing_Error: "3."
- Condition: "Hepatic insufficiency"
- Measurement: "total bilirubin"
- Value: "> 2 mg/dL"
- Measurement: "serum albumin"
- Value: "< 25 g/L"
- Parsing_Error: "4."
- Measurement: "HbA1c"
- Value: "> 9%"
- Parsing_Error: "5."
- Measurement: "Hemoglobin"
- Value: "< 10 g/dL"
- Parsing_Error: "6."
- Measurement: "Hematocrit"
- Value: "< 0.30"
- Parsing_Error: "7."
- Measurement: "Platelet count"
- Value: "< 100,000"
- Parsing_Error: "10."
- Condition: "local cancer"
- Condition: "systemic cancer"
- Temporal: "active"
- Condition: "tumor of any kind"
- Condition: "non-melanoma skin cancer"
- Negation: "with the exception of"
- Parsing_Error: "11."
- Condition: "rheumatoid arthritis"
- Qualifier: "severe"
- Multiplier: "more than 20"
- Condition: "inflamed joints"
- Temporal: "persistently"
- Measurement: "blood albumin level"
- Value: "below lower normal limit"
- Condition: "bone and cartilage damage"
- Procedure: "x-ray"
- Condition: "inflammation in tissues other than joints"
- Condition: "collagen vascular diseases"
- Parsing_Error: "12."
- Condition: "connective tissue disease"
- Temporal: "active"
- Parsing_Error: "13."
- Drug: "systemic corticosteroids"
- Value: ">15 mg/day"
- Procedure: "Treatment"
- Drug: "immunosuppressive agents"
- Temporal: "current"
- Parsing_Error: "14."
- Procedure: "radiation therapy"
- Non-query-able: "likelihood to"
- Subjective_judgement: "likelihood to"
- Temporal: "Previous"
- Temporal: "current"
- Parsing_Error: "15."
- Condition: "Pregnant"
- Condition: "nursing"
- Parsing_Error: "16."
- Non-query-able: "Known prior inability or unavailability to complete required study visits during study participation"
- Context_Error: "required study visits"
- Parsing_Error: "17."
- Condition: "peripheral edema"
- Qualifier: "Significant"
- Subjective_judgement: "Significant"
- Subjective_judgement: "as per investigator's discretion"
- Parsing_Error: "18."
- Condition: "psychiatric condition"
- Condition: "suicidal ideation"
- Condition: "alcohol abuse problem"
- Condition: "drug abuse problem"
- Subjective_judgement: "in the opinion of the investigator"
- Subjective_judgement: "pose a threat"
- Qualifier: "may pose a threat to patient compliance"
- Parsing_Error: "19."
- Drug: "platelet-derived growth factor"
- Temporal: "within 28 days before screening"
- Reference_point: "screening"
- Parsing_Error: "20."
- Drug: "investigational drug"
- Procedure: "investigational therapy"
- Temporal: "within 28 days before screening"
- Reference_point: "screening"
- Parsing_Error: "21."
- Subjective_judgement: "Has any other factor which may, in the opinion of the investigator, compromise participation and/or follow-up in the study"
- Context_Error: "Has any other factor which may, in the opinion of the investigator, compromise participation and/or follow-up in the study"
- Non-query-able: "Has any other factor which may, in the opinion of the investigator, compromise participation and/or follow-up in the study"